La toxina botulínica:
1. Se produce en heridas infectadas y mal aireadas.
2. Bloquea la síntesis de proteínas.
3. Bloquea la secreción de acetilcolina en la placa mioneural.
4. Interfiere con la transmisión del impulso nervioso a nivel de los axones.
5. Provoca necrosis de las terminaciones nerviosas.

Respuesta correcta: 3. Bloquea la secreción de acetilcolina en la placa mioneural.